Clinical trial exclusion criterion:
Renal transplants from HLA-identical sibling.

Annotated entities:
- Procedure: "Renal transplants"
- Qualifier: "HLA-identical sibling"